Clinical trial exclusion criterion:
8. Taking other drugs known to reduce the metabolism of minocycline and thus increase the probability of toxicity.

Annotated entities:
- Drug: "minocycline"
- Non-representable: "reduce the metabolism of minocycline"
- Non-representable: "Taking other drugs known to reduce the metabolism of minocycline and thus increase the probability of toxicity."